排卵時體溫升高主要是受那一種荷爾蒙的影響？
A. 助孕酮（progesterone）
B. 睪固酮（testosterone）
C. 雌二醇（estradiol）
D. 皮質醇（cortisol）

正確答案：A. 助孕酮（progesterone）